Señale la respuesta correcta respecto a las fuerzas que influyen en la filtración a través de los capilares de los glomérulos renales (Filtración Glomerular) que se lleva a cabo en el corpúsculo renal:
1. La presión hidrostática de la sangre que circula por los capilares glomerulares favorece la filtración hacia la cápsula de Bowman.
2. La presión coloidosmótica debida a las proteínas plasmáticas dentro de los capilares glomerulares favorece la filtración hacia la cápsula de Bowman.
3. La presión hidrostática del líquido dentro de la cápsula de Bowman favorece la filtración hacia la cápsula de Bowman.
4. El gradiente neto de la suma de estas tres presiones es de 100 mm Hg a favor de la filtración.
5. Todas las anteriores son correctas.

Respuesta correcta: 1. La presión hidrostática de la sangre que circula por los capilares glomerulares favorece la filtración hacia la cápsula de Bowman.